Clinical trial inclusion criterion:
Age range: 7 to 14 years-old;

Entity relations:
- Has_value("Age", "7 to 14 years-old")